25歲年輕男子，因騎乘重型機車發生事故，造成嚴重骨盆骨折（pelvic fracture）。抵達急診時呈現休克，經大量輸液與輸血灌救後，收縮壓高於90 mmHg，並隨即接受腹部電腦斷層攝影檢查。但發現骨盆腔出現顯影劑外滲（contrast  extravasation）。下列何種治療方法治療出血性休克效果最佳？
A. 繼續輸血（transfusion）
B. 骨盆外固定（external fixation）
C. 剖腹手術結紮髂外動脈（external iliac artery ligation）
D. 血管栓塞術（angio-embolization）

正確答案：D. 血管栓塞術（angio-embolization）